majors clinical conditions

The above is a clinical trial exclusion criterion. Annotated with entity spans:
[Condition: majors clinical conditions]